Clinical trial inclusion criterion:
The cirrhotic malnourished patients who were diagnosed as liver cancer preoperatively and underwent hepatectomy were consecutively enrolled.

Entity relations:
- Has_temporal("liver cancer", "preoperatively")